下列各種細胞接合（intercellular junction），何者與中間絲（intermediate filaments）連結？
A. 閉鎖小帶（zonula occludens）
B. 黏	小帶（zonula adherens）
C. 黏	斑（macula adherens）
D. 局部黏	（focal adhesions）

正確答案：C. 黏	斑（macula adherens）